Popliteal artery stenosis >50% at P2 or P3 segment

The above is a clinical trial exclusion criterion. Annotated with entity spans:
[Condition: Popliteal artery stenosis] [Value: >50%] at [Qualifier: P2 or P3 segment]